Clinical trial exclusion criterion:
spine surgery in past

Annotated entities:
- Procedure: "spine surgery"
- Temporal: "in past"